Clinical trial exclusion criterion:
Patients on longstanding NSAID therapy

Entity relations:
- Has_temporal("NSAID therapy", "longstanding")